Clinical trial inclusion criterion:
Creatinine <_1.6 mg/dl or creatinine clearance >_60 cc/min.

Annotated entities:
- Measurement: "Creatinine"
- Value: "<_1.6 mg/dl"
- Measurement: "creatinine clearance"
- Value: ">_60 cc/min"